La alucinación extracampina se caracteriza porque:
1. Es una alucinación que se experimenta fuera del campo visual.
2. Se trata de una variedad mórbida de la sinestesia.
3. La percepción correcta del estímulo se superpone a la alucinación.
4. La alucinación está en función de estímulos externos, apareciendo y desapareciendo con ellos.

Respuesta correcta: 1. Es una alucinación que se experimenta fuera del campo visual.